一位53歲男性，有長期高血壓病史，突發撕裂性胸痛且轉移至背部及腹部，血壓210/110 mmHg。他另外的主 訴為右下肢痛，身體檢查發現摸不到右側股動脈脈搏，右下肢蒼白冰冷、腳趾無法活動，此時下列那一項處
 置較適當？
A. 維持收縮壓在150 mmHg以上，以確保適當的末肢循環
B. 避免使用止痛藥，以免影響病情的觀察及血壓的監控
C. 使用肝素（heparin），以免動脈阻塞更加厲害
D. 立即安排電腦斷層檢查

正確答案：D. 立即安排電腦斷層檢查